Según el artículo 15 de la Ley de Prevención de Riesgos Laborales, NO se considera un principio en la actividad preventiva:
1. Evitar los riesgos y combatirlos desde su origen.
2. Adaptar el trabajo a la persona.
3. Adoptar medidas que antepongan la protección individual a la colectiva.
4. Sustituir lo peligroso por lo que suponga poco o ningún peligro.
5. Formación de los trabajadores.

Respuesta correcta: 3. Adoptar medidas que antepongan la protección individual a la colectiva.